Clinical trial exclusion criterion:
Acute heart failure or acute exacerbation of chronic heart failure within the past 2 weeks.

Entity relations:
- AND("chronic heart failure", "exacerbation")
- Has_qualifier("exacerbation", "acute")
- Has_temporal("Acute heart failure", "within the past 2 weeks")
- OR("Acute heart failure", "chronic heart failure")